Clinical trial inclusion criterion:
American Society of Anesthesiologists Classification I-III

Annotated entities:
- Observation: "American Society of Anesthesiologists Classification"
- Value: "I-III"